Which type of analysis does DeSeq2 perform?

DeSeq2 enables differential gene expression analysis of multiple cellular origins.